下列何者不是雌激素對子宮頸分泌物之影響？
A. 呈透明黏液狀的分泌物
B. 在鏡檢下呈現羊齒狀
C. 良好的延展性
D. 呈濃厚、不透明的分泌物

正確答案：D. 呈濃厚、不透明的分泌物